Clinical trial exclusion criterion:
Known allergy/sensitivity or any hypersensitivity to components of study drugs or their formulation.

Entity relations:
- AND("allergy", "components of study drugs")
- OR("allergy", "hypersensitivity", "sensitivity")